Clinical trial inclusion criterion:
Known allergies against ingredients of the investigational products

Annotated entities:
- Condition: "allergies"
- Drug: "ingredients of the investigational products"